Psychiatric, cognitive disorders, mental retardation;

The above is a clinical trial exclusion criterion. Annotated with entity spans:
[Condition: Psychiatric, cognitive disorders], [Condition: mental retardation];